Clinical trial exclusion criterion:
Other contra-indications to liraglutide in accordance with risks and safety information included in the latest updated prescribing information

Annotated entities:
- Drug: "liraglutide"
- Condition: "contra-indications"
- Qualifier: "Other"